Clinical trial exclusion criterion:
Patients with systolic blood pressure <100 mmHg or basal heart rate <60/min

Entity relations:
- Has_value("systolic blood pressure", "<100 mmHg")
- Has_qualifier("heart rate", "basal")
- Has_value("heart rate", "<60/min")
- OR("systolic blood pressure", "heart rate")